Los métodos estadísticos no-paramétricos:
1. No requieren ningún dato.
2. No hacen suposiciones sobre la distribución de datos.
3. Solamente se aplican a tipos de resultados muy específicos.
4. Generalmente asumen una distribución de chi-cuadrado.

Respuesta correcta: 2. No hacen suposiciones sobre la distribución de datos.